肺氣腫與下列何者最相關？
A. 彈性蛋白分解酶（elastase）
B. 夏萊二氏晶體（Charcot-Leyden crystals）
C. 補體（complement）
D. 急性發炎化學調節因子（chemical mediators）

正確答案：A. 彈性蛋白分解酶（elastase）